SBP=180mmHg, or DBP=110mmHg;

The above is a clinical trial exclusion criterion. Annotated with entity spans:
[Measurement: SBP][Value: =180mmHg], or [Measurement: DBP][Value: =110mmHg];